下列關於淚液（tear）的敘述，何者錯誤？
A. 淚液層由外（空氣）到內（眼表面）可分為油脂層 （lipid layer）、水液層（aqueous layer）、黏液層
B. 油脂層主要由眼瞼板的瞼板腺（meibomian gland）分泌
C. 黏液層的作用為避免水分的蒸散
D. 水液層的基礎分泌量在睡眠時最少

正確答案：C. 黏液層的作用為避免水分的蒸散